Clinical trial inclusion criterion:
Diagnosis reviewed at transplant center and confirmed to fit the criterion for high risk blood disease or cancer, as defined for the study

Entity relations:
- OR("high risk blood disease", "cancer")